alcohol abuse

The above is a clinical trial exclusion criterion. Annotated with entity spans:
[Condition: alcohol abuse]